Clinical trial exclusion criterion:
Significant (as defined by the PI) intolerance of presently-used DMT

Entity relations:
- Has_temporal("DMT", "presently-used")
- AND("intolerance", "DMT")
- Has_qualifier("intolerance", "Significant")